Age 19 years of age or older (The age of consent in Nebraska)

The above is a clinical trial inclusion criterion. Annotated with entity spans:
[Person: Age] [Value: 19 years of age or older] [Non-representable: (The age of consent in Nebraska)]